Anemia defined as Hemoglobin (Hb) < 115 g/L (7.1 mM) in women and < 120 g/L (7.5 mM) in men.

The above is a clinical trial exclusion criterion. Annotated with entity spans:
[Condition: Anemia] defined as [Measurement: Hemoglobin (Hb)] [Value: < 115 g/L] ([Value: 7.1 mM]) in [Person: women] and [Value: < 120 g/L] ([Value: 7.5 mM]) in [Person: men].